下列何者為慢性紅斑性狼瘡（chronic cutaneous lupus erythematosus）的特徵？
A. 最常見的臨床表現狼瘡性脂肪炎（lupus panniculitis）
B. 凍瘡型紅斑性狼瘡（chilblain lupus erythematosus）好發於冬季低溫季節，常發生在軀幹部位
C. 典型的圓盤型紅斑性狼瘡（classic discoid lupus erythematosus）病人大約只有5%最後會演變成全身型紅斑性狼瘡（systemic lupus erythematosus）
D. 肥厚型紅斑性狼瘡（hypertrophic discoid lupus erythematosus）是因為真皮有黏液素（mucin）沉積，才造成肥厚外觀

正確答案：C. 典型的圓盤型紅斑性狼瘡（classic discoid lupus erythematosus）病人大約只有5%最後會演變成全身型紅斑性狼瘡（systemic lupus erythematosus）